Clinical trial inclusion criterion:
Subject has structural normal heart with an LVEF = 50%, thickness of the inter-ventricular septum =12 mm and left atrium diameters (short axis) < 46 mm obtained by transthoracic echocardiography.

Entity relations:
- Has_qualifier("heart", "normal")
- Has_qualifier("heart", "structural")
- Has_value("LVEF", "= 50%,")
- Has_value("thickness of the inter-ventricular septum", "=12 mm")
- Subsumes("left atrium diameters", "short axis")
- Has_value("left atrium diameters", "< 46 mm")
- AND("transthoracic echocardiography", "LVEF")
- AND("heart", "transthoracic echocardiography")
- AND("transthoracic echocardiography", "thickness of the inter-ventricular septum")
- AND("transthoracic echocardiography", "left atrium diameters")